Clinical trial exclusion criterion:
Previous gastric resection

Entity relations:
- Has_temporal("gastric resection", "Previous")